20歲的張同學騎機車時，正面撞擊停在路邊的車子，結果右膝撞擊機車的前檔板。當天該膝關節並未明顯腫 脹，急診室拍的X光片也顯示沒有骨折；雖然膝關節活動有些疼痛，但是大致上還能行走。一個月後，右膝已經幾乎不再疼痛，不過他發現走路時右膝有時會有瞬間無法支撐體重、忽然軟弱無力的感覺；尤其走下樓
 梯時最為困擾，他很害怕會從樓梯上滾下來。張同學最有可能發生了：
A. 前十	韌帶（anterior cruciate ligament）斷裂
B. 後十	韌帶（posterior cruciate ligament）斷裂
C. 髕骨半脫位（patellar subluxation）
D. 內側副韌帶（medial collateral ligament）斷裂

正確答案：B. 後十	韌帶（posterior cruciate ligament）斷裂